Describe Exploding head syndrome.

Exploding head syndrome is characterized by the perception of abrupt, loud noises when going to sleep or waking up.